Clinical trial exclusion criterion:
10. Severe anemia (hemoglobin <8 g/dL)

Annotated entities:
- Condition: "anemia"
- Qualifier: "Severe"
- Measurement: "hemoglobin"
- Value: "<8 g/dL"